using daily medication for chronic condition

The above is a clinical trial exclusion criterion. Annotated with entity spans:
using [Multiplier: daily] [Drug: medication] for [Condition: chronic condition]